有關副食品添加的原則，下列何者最不適當？
A. 母乳哺餵的孩子到6個月大時必須添加
B. 有過敏體質的嬰兒宜延後到8個月大時添加
C. 1歲以下嬰兒避免餵食蜂蜜
D. 每次只添加一種新食物，由少量開始，逐漸增加，觀察4至7天

正確答案：B. 有過敏體質的嬰兒宜延後到8個月大時添加